下列何期開始時，胎兒的頭長約占其頭踵長（crown-heel length）的一半？
A. 次三月期（second trimester）
B. 胚期（embryonic period）
C. 胎期（fetal period）
D. 胎動期（stage of quickening）

正確答案：C. 胎期（fetal period）